20. Examinations (physical examination, X-ray examination, type-B ultrasonic detection or other methods) reveal that the subject has malignant mass, gland hyperplasia or adenoma with endocrine activity, or impact on heart, or endocrine function (such as pheochromocytoma, thyroid enlargement);

The above is a clinical trial exclusion criterion. Annotated with entity spans:
20. [Procedure: Examinations] ([Procedure: physical examination], [Procedure: X-ray examination], [Procedure: type-B ultrasonic detection] or [Procedure: other methods]) reveal that the subject has [Condition: malignant mass], [Condition: gland hyperplasia] or [Condition: adenoma] [Qualifier: with endocrine activity], or [Condition: impact on heart], or endocrine function (such as [Condition: pheochromocytoma], [Condition: thyroid enlargement]);